5. Pregnancy or breastfeeding

The above is a clinical trial exclusion criterion. Annotated with entity spans:
[Parsing_Error: 5.] [Condition: Pregnancy] or [Observation: breastfeeding]